在心臟上方，將動脈群包括主動脈（ascending aorta）及肺動脈幹（pulmonary trunk），與靜脈群包括肺靜脈 （pulmonary vein）及上腔靜脈（superior vena cava）兩者分開的是：
A. 心包膜橫竇（transverse pericardial sinus）
B. 心包膜斜竇（oblique pericardial sinus）
C. 冠狀竇（coronary sinus）
D. 心包膜腔胸骨面（sternal surface of pericardial cavity）

正確答案：A. 心包膜橫竇（transverse pericardial sinus）